一位 11 歲小朋友不小心被瞬間黏著劑（cyanoacrylate adhesives）滴入眼睛，下列處置何者錯誤？
A. 因為會造成永久性角膜的傷害，所以必須立即清除
B. 儘快短時間內安排眼科醫師急診或門診
C. 對角膜的傷害主要是經由機械性磨擦引起
D. Erythromycin ointment 可用來處理黏著劑造成角膜的沾黏

正確答案：A. 因為會造成永久性角膜的傷害，所以必須立即清除